Clinical trial inclusion criterion:
signed informed consent

Annotated entities:
- Observation: "signed informed consent"